下列何者不是右心室衰竭之臨床表現？
A. 端坐呼吸（orthopnea）
B. 頸靜脈怒脹（engorgement）
C. 下肢水腫
D. 肝臟腫大

正確答案：A. 端坐呼吸（orthopnea）